Clinical trial inclusion criteria:
Type I or II diabetes mellitus.
Target ulcer area between 0.5 and 5 sqcm, and more than 4 weeks old.
Ankle-brachial pressure index above 0.7.

Annotated entities:
- Condition: "Type II diabetes mellitus"
- Condition: "Type I diabetes mellitus"
- Measurement: "Target ulcer area"
- Value: "between 0.5 and 5 sqcm"
- Temporal: "more than 4 weeks old"
- Measurement: "Ankle-brachial pressure index"
- Value: "above 0.7"